Clinical trial exclusion criterion:
asthma requiring regular therapy

Entity relations:
- AND("asthma", "regular therapy")